Clinical trial inclusion criterion:
One relapse in the previous year and at least 1 T1 Gadolinium (Gd)+ lesion or 9 or more T2 lesions, while on therapy with other disease modifying drugs (DMDs)

Annotated entities:
- Multiplier: "One"
- Condition: "relapse"
- Temporal: "in the previous year"
- Multiplier: "at least 1"
- Condition: "lesion"
- Qualifier: "T1 Gadolinium (Gd)+"
- Multiplier: "9 or more"
- Condition: "T2 lesions"
- Temporal: "while on therapy"
- Reference_point: "therapy"
- Procedure: "therapy"
- Drug: "disease modifying drugs (DMDs)"
- Qualifier: "other"